Clinical trial exclusion criterion:
eGFR < 60 ml/min/1,73 m2 (MDRD-formula, confirmed on a second day)

Entity relations:
- Has_value("eGFR", "< 60 ml/min/1,73 m2")